Clinical trial inclusion criterion:
Pathologically proven unresectable adenocarcinoma of stomach

Entity relations:
- Has_qualifier("adenocarcinoma of stomach", "unresectable")
- Has_value("Pathologically", "proven")
- AND("unresectable", "Pathologically")